eGFR < 60 ml/min/1,73 m2 (MDRD-formula, confirmed on a second day)

The above is a clinical trial exclusion criterion. Annotated with entity spans:
[Measurement: eGFR] [Value: < 60 ml/min/1,73 m2] (MDRD-formula, confirmed on a second day)